List orally bioavailable MPS1 kinase inhibitors

1 h-pyrrolo [3,2-c] pyridine, cct271850, nms-p715, 4-aminopyrazolo, bos172722, cCT251455.